En los seres humanos, la síntesis de aspartato a partir de oxalacetato está catalizada por:
1. Oxalacetato descarboxilasa.
2. Aspartato sintetasa.
3. Aspartato deshidrogenasa.
4. Transaminasa dependiente de piridoxal fostato.
5. Oxalacetato ligasa.

Respuesta correcta: 4. Transaminasa dependiente de piridoxal fostato.